Age range: 18-45 years

The above is a clinical trial inclusion criterion. Annotated with entity spans:
[Person: Age] range: [Value: 18-45 years]